Clinical trial exclusion criterion:
6. Hemoglobin < 10 Gms/dL.

Entity relations:
- Has_value("Hemoglobin", "< 10 Gms/dL")